Clinical trial exclusion criterion:
serious concomitant illness and malignant tumor of any kind

Annotated entities:
- Qualifier: "serious"
- Temporal: "concomitant"
- Condition: "illness"
- Condition: "malignant tumor"
- Qualifier: "any kind"